Age 18 - 75 years

The above is a clinical trial inclusion criterion. Annotated with entity spans:
[Person: Age] [Value: 18 - 75 years]